Clinical trial exclusion criterion:
Patients with allergies or contraindications to study medications

Entity relations:
- AND("allergies", "study medications")
- OR("allergies", "contraindications")